intracranial surgery

The above is a clinical trial exclusion criterion. Annotated with entity spans:
[Procedure: intracranial surgery]